假設甲、乙兩圓柱硬管有相同之長度與半徑，所流經之液體的黏滯性（viscosity）亦相同。若甲管兩端點之壓力分別為 105 mmHg 與 5 mmHg，而乙管分別為 605 mmHg 與 505 mmHg，則下列何者正確？
A. 甲管之流速等於乙管之流速
B. 甲管之流速高於乙管之流速
C. 甲管之流速低於乙管之流速
D. 甲、乙兩管之流速皆為零

正確答案：A. 甲管之流速等於乙管之流速